cauda equina or conus lesion

The above is a clinical trial exclusion criterion. Annotated with entity spans:
[Qualifier: cauda equina] or [Qualifier: conus] [Condition: lesion]